下列有關瘧疾的敘述，何者錯誤？
A. 預防間日瘧之復發（relapse），宜用 primaquine
B. 瘧疾發作（paroxysm）之過程依序為：惡寒（chill）、發燒（fever）、發汗（sweat）
C. 瘧疾的主要症狀為：發燒、貧血、肝腫大
D. 惡性瘧患者周邊血液中，通常較不易發現裂殖體（schizonts）

正確答案：C. 瘧疾的主要症狀為：發燒、貧血、肝腫大